Clinical trial inclusion criterion:
Require no red blood cell transfusion or dependent on <4 units within 8 weeks prior to screening

Annotated entities:
- Procedure: "red blood cell transfusion"
- Negation: "no"
- Multiplier: "<4 units"
- Temporal: "within 8 weeks prior to screening"